Subject with clinical evidence of renal disease with the past 6 months, defined as estimated glomerular filtration rate (GFR) outside the normal reference range.

The above is a clinical trial exclusion criterion. Annotated with entity spans:
Subject with clinical evidence of [Condition: renal disease] [Temporal: with the past 6 months], defined as [Measurement: estimated glomerular filtration rate (GFR)] [Value: outside] the [Reference_point: normal reference range].